5. ADC Stage > 1.

The above is a clinical trial exclusion criterion. Annotated with entity spans:
5. [Measurement: ADC Stage] [Value: > 1].